Clinical trial exclusion criteria:
Allergy to any of proposed medications
Patients with any active infection including HBV, HCV and HIV.

Annotated entities:
- Condition: "Allergy"
- Drug: "proposed medications"
- Condition: "active infection"
- Condition: "HBV"
- Condition: "HCV"
- Condition: "HIV"